Clinical trial exclusion criterion:
Known immediate or delayed hypersensitivity reaction or idiosyncrasy to drugs chemically related to panitumumab or excipients that contraindicates their participation.

Annotated entities:
- Condition: "delayed hypersensitivity reaction"
- Condition: "immediate hypersensitivity reaction"
- Condition: "idiosyncrasy"
- Drug: "drugs chemically related to panitumumab"
- Drug: "drugs chemically related to panitumumab excipients"